Clinical trial inclusion criteria:
Infants in the newborn intensive care unit
TPN cholestasis of at least 2.5 mg/dl
Anticipated TPN treatment for at least one month
signed informed consent

Annotated entities:
- Visit: "newborn intensive care unit"
- Person: "Infants"
- Condition: "TPN cholestasis"
- Multiplier: "at least 2.5 mg/dl"
- Procedure: "TPN treatment"
- Multiplier: "for at least one month"
- Informed_consent: "signed informed consent"